Clinical trial exclusion criterion:
Lack of safe double contraception (see 7.1)

Annotated entities:
- Pregnancy_considerations: "Lack of safe double contraception (see 7.1)"